Las proteínas pueden exhibir un espectro de emisión fluorescente debido a la presencia de los siguientes fluoróforos intrínsecos que absorben radiación en la región del UV- próximo:
1. Alanina, valina, glicina.
2. Triptófano, tirosina, fenilalanina.
3. Serina, metionina, asparagina.
4. Cisteína, alanina, metionina.
5. Ninguna de las anteriores es correcta, las proteínas nunca exhiben fluorescencia.

Respuesta correcta: 2. Triptófano, tirosina, fenilalanina.